Has Eastern Cooperative Oncology Group (ECOG) performance status of 0 or 1 performed within 7 days prior to receiving the first dose of study medication

The above is a clinical trial inclusion criterion. Annotated with entity spans:
Has [Measurement: Eastern Cooperative Oncology Group (ECOG) performance status] of [Value: 0 or 1] performed [Temporal: within 7 days prior] to [Reference_point: receiving the first dose of study medication]